Clinical trial exclusion criterion:
9. History of myocardial infarction, angina, congestive heart failure, cardiomyopathy, stroke or transient ischemic attack, or any heart condition currently under medical care.

Annotated entities:
- Parsing_Error: "9."
- Condition: "myocardial infarction"
- Condition: "angina"
- Condition: "congestive heart failure"
- Condition: "cardiomyopathy"
- Condition: "stroke"
- Condition: "transient ischemic attack"
- Condition: "heart condition"
- Qualifier: "under medical care"
- Temporal: "currently"
- Undefined_semantics: "heart condition currently under medical care"
- Temporal: "History"